Clinical trial inclusion criterion:
hysterectomy

Annotated entities:
- Procedure: "hysterectomy"